contraindication to treatment drugs,

The above is a clinical trial inclusion criterion. Annotated with entity spans:
[Condition: contraindication] to [Drug: treatment drugs],